Clinical trial inclusion criterion:
Life expectancy greater than one year.

Entity relations:
- Has_value("Life expectancy", "greater than one year")